Clinical trial exclusion criterion:
Documented untreated ventricular arrhythmia with syncopal episodes within the 3 months.

Entity relations:
- Has_qualifier("ventricular arrhythmia", "untreated")
- AND("ventricular arrhythmia", "syncopal episodes")
- Has_temporal("syncopal episodes", "within the 3 months")